建立人類的genomic library不可能需要下列那一種材料？
A. DNA ligase
B. bacteriophage lambda
C. reverse transcriptase
D. restriction enzymes

正確答案：C. reverse transcriptase